張老先生今天早上因為神智變得不清被家人帶來門診。70 歲的老先生除了高血壓外身體一向硬朗。家人敘述大約 3 個月前大清早到公園例行運動時因路滑跌了一跤。當時頭部有輕微擦傷，因自覺沒有問題，馬上起身自行走路回家。兩個月前，張老先生早上醒來有輕微頭痛現象，走路時速度慢了下來。近一個月，張老先生走路更慢，有時會尿褲子。這幾天常常會叫錯妻子兒女名字，甚至有時神智變得不清。最可能的診斷是：
A. 硬腦膜下血腫（subdural hematoma）
B. 阿茲海默症（Alzheimer's disease）
C. 腦震盪（brain concussion）
D. 老年憂鬱症（Depression）

正確答案：A. 硬腦膜下血腫（subdural hematoma）